Glaucoma,

The above is a clinical trial exclusion criterion. Annotated with entity spans:
[Condition: Glaucoma],